Clinical trial exclusion criterion:
3. Patients with other nervous system diseases(e.g., cerebral tumor, neurinoma, trigeminal neuralgia,etc)

Annotated entities:
- Condition: "nervous system diseases"
- Condition: "cerebral tumor"
- Condition: "neurinoma"
- Condition: "trigeminal neuralgia"